Uno de los tests más utilizados en la evaluación neuropsicológica del deterioro cognitivo general es:
1. Mini-Menal State Examination (MMSE) de Folstein (1975).
2. Geratric Scale (GS) de Yesavage (1983).
3. WISC-IV de Welcher (2005).
4. Batería de Evaluación del Potencial de Aprendizaje en Demencias (BEPAD) (Fernández Ballesteros et al., 2003).

Respuesta correcta: 1. Mini-Menal State Examination (MMSE) de Folstein (1975).